下列有關個案對照研究（case-control study）「配對（matching）」的敘述，何者錯誤？
A. 在個案對照法可增加效率
B. 以密度取樣法是以時間配對取對照組
C. 配對可增加各受測者資料量
D. 配對之目的在增加研究設計之效度

正確答案：D. 配對之目的在增加研究設計之效度